El linfoma de Burkitt y el carcinoma nasofaríngeo están relacionados con la infección por:
1. Herpes virus humano tipo 6.
2. Citomegalovirus.
3. Virus respiratorio sincitial.
4. Virus de Epstein-Barr.
5. Virus de la inmunodeficiencia humana.

Respuesta correcta: 4. Virus de Epstein-Barr.